下列何種器官之內襯是「移行上皮（transitional epithelium）」？
A. 膀胱（urinary bladder）
B. 氣管（trachea）
C. 食道（esophagus）
D. 膽囊（gall bladder）

正確答案：A. 膀胱（urinary bladder）